有關氣管食道瘻管的臨床表現，下列何者較不常見？
A. 大量的氣管分泌物的產生
B. 呼吸音可聽到stridor
C. X光常可見到胃脹氣的現象
D. 易伴隨呼吸道或肺部感染

正確答案：B. 呼吸音可聽到stridor